Clinical trial exclusion criterion:
ASA 3+

Annotated entities:
- Condition: "ASA 3+"